Roflumilast Cream is effective for which disease?

Roflumilast Cream has been shown to be effective for psoriasis.